LV ejection fraction < 50%.

The above is a clinical trial exclusion criterion. Annotated with entity spans:
[Measurement: LV ejection fraction] [Value: < 50%].